Clinical trial exclusion criterion:
Subjects who have participated on any other research clinical trials on the last 40 days

Annotated entities:
- Competing_trial: "Subjects who have participated on any other research clinical trials on the last 40 days"